鄭小姐是一位 47 歲職業婦女，由先生陪同來到門診。主訴除了失眠外亦合併胸悶、頭痛、食慾減低、體重減輕、活力減低，記憶力與注意力下降，而且對許多事情失去興趣。鄭小姐這半年來反覆在不同醫療院所求醫，但是症狀並未明顯改善，而且若干檢查（抽血、影像檢查）又無法釐清病因，心情也因此更加低落，並被診斷為憂鬱症。下列臨床處理，何者錯誤？
A. 治療失眠問題
B. 針對長期壓力的調適提供行為治療
C. 短期一至二週的抗憂鬱藥物，症狀即會有大幅改善
D. 有自殺意圖時立刻轉介精神科

正確答案：C. 短期一至二週的抗憂鬱藥物，症狀即會有大幅改善